Clinical trial exclusion criterion:
acute or unstable medical disease,

Annotated entities:
- Condition: "medical disease"
- Qualifier: "acute"
- Qualifier: "unstable"